Clinical trial exclusion criterion:
Hematocrit (Hct) > 50%

Annotated entities:
- Measurement: "Hematocrit (Hct)"
- Value: "> 50%"